Age = 65 years with one additional stroke risk factor (hypertension, diabetes, heart failure history of or left ventricular ejection fraction <0.40), previous stroke or transient ischemic attack).

The above is a clinical trial inclusion criterion. Annotated with entity spans:
[Person: Age] [Value: = 65 years] with [Multiplier: one additional] [Condition: stroke] [Condition: risk factor] ([Condition: hypertension], [Condition: diabetes], [Condition: heart failure] [Temporal: history] of or [Measurement: left ventricular ejection fraction] [Value: <0.40]), [Temporal: previous] [Condition: stroke] or [Condition: transient ischemic attack]).